Clinical trial exclusion criterion:
Patients who are currently receiving quetiapine therapy may not undergo a washout period and then restart quetiapine in the study.

Annotated entities:
- Non-representable: "Patients who are currently receiving quetiapine therapy may not undergo a washout period and then restart quetiapine in the study"